Clinical trial exclusion criterion:
Patients with underlying disease cases without the possibility of resuscitation (e.g., terminal cancer);

Entity relations:
- Has_qualifier("underlying disease", "without the possibility of resuscitation")